Clinical trial inclusion criterion:
Are assessed by the clinic staff as being at low risk for HIV infection

Entity relations:
- AND("HIV infection", "low risk")